Clinical trial exclusion criterion:
Known or suspected, acquired or bleeding or coagulation disorder in the subject or a first degree relative

Annotated entities:
- Mood: "Known"
- Mood: "suspected"
- Condition: "coagulation disorder"
- Condition: "bleeding disorder"
- Condition: "acquired disorder"
- Person: "in the subject"
- Person: "first degree relative"